Clinical trial inclusion criterion:
Is an adapted Avaira sphere contact lens wearer (at least 1 week in Avaira sphere)

Annotated entities:
- Device: "Avaira sphere contact lens"
- Temporal: "at least 1 week in Avaira sphere"
- Reference_point: "Avaira sphere"
- Device: "Avaira sphere"